下列何者指的是「兩隻眼球往相對或相反方向之非共軛性（non-conjugate）運動」？
A. 眼移動（duction）
B. 眼轉向（version）
C. 眼聚散轉動（vergence）
D. 眼調節（accommodation）

正確答案：C. 眼聚散轉動（vergence）